Men and women between ages >=18 and 65.

The above is a clinical trial inclusion criterion. Annotated with entity spans:
[Person: Men] [Parsing_Error: and] [Person: women] [Value: between] [Person: ages] [Parsing_Error: >=]18 and 65.